positive drug screen at the time of delivery

The above is a clinical trial exclusion criterion. Annotated with entity spans:
[Value: positive] [Measurement: drug screen] [Temporal: at the time of delivery]